Weight stable (<3 kg weight change within last 3 months)

The above is a clinical trial inclusion criterion. Annotated with entity spans:
[Measurement: Weight] [Qualifier: stable] ([Value: <3 kg weight change] [Temporal: within last 3 months])